1. Age: 18 years and older.

The above is a clinical trial inclusion criterion. Annotated with entity spans:
1. [Person: Age]: [Value: 18 years and older].